Clinical trial inclusion criterion:
On multiple daily insulin injections, including basal long-acting insulin and rapid-acting insulin before each meal.

Annotated entities:
- Drug: "insulin"
- Qualifier: "daily"
- Drug: "insulin"
- Drug: "insulin"
- Qualifier: "rapid-acting"
- Qualifier: "basal long-acting"